腎臟體積變大主要是因為下列何者長度增加所致？
A. 遠端彎曲小管（distal convoluted tubule）
B. 集尿管（collecting duct）
C. 近端彎曲小管（proximal convoluted tubule）
D. 輸尿管（ureter）

正確答案：C. 近端彎曲小管（proximal convoluted tubule）